Clinical trial exclusion criterion:
Patients with >14 follicles on day of trigger

Annotated entities:
- Value: ">14"
- Measurement: "follicles"
- Temporal: "on day of trigger"
- Reference_point: "day of trigger"